Evidence of current hepatitis C virus infection (HCV) (ie, HCV antibody [Ab] positive within 90 days prior to study entry unless also shown to be plasma HCV RNA negative within the same time period)

The above is a clinical trial exclusion criterion. Annotated with entity spans:
[Mood: Evidence] of [Temporal: current] [Condition: hepatitis C virus infection (HCV)] (ie, [Measurement: HCV antibody [Ab]] [Value: positive] [Temporal: within 90 days prior to study entry] unless also shown to be [Measurement: plasma HCV RNA] [Value: negative] [Temporal: within the same time period])